¿Cuál de los siguientes en un oncogen cuyo producto de transcripción es un receptor de membrana con actividad tirosin kinasa de un factor de crecimiento?
1. HER2/neu.
2. p53.
3. myc.
4. APC.
5. Ras.

Respuesta correcta: 1. HER2/neu.